Clinical trial exclusion criterion:
contra-indication to the use of rocuronium

Annotated entities:
- Condition: "contra-indication"
- Drug: "rocuronium"